臀肌粗隆（gluteal tuberosity）位於何處？
A. 髂骨（ilium）
B. 坐骨（ischium）
C. 恥骨（pubis）
D. 股骨（femur）

正確答案：D. 股骨（femur）